下列何種藥物不會抑制 warfarin 的代謝？
A. amiodarone
B. aspirin
C. trimethoprim
D. disulfiram

正確答案：B. aspirin